eGFR <45 ml/min

The above is a clinical trial exclusion criterion. Annotated with entity spans:
[Measurement: eGFR] [Value: <45 ml/min]